Clinical trial inclusion criterion:
Patient with high risk of bleeding as defined by (1) HASBLED score =3 OR (2) HASBLED = CHADS2VASC score, OR (3) recent history of severe bleeding (type 3a, 3b, 3c), particularly cerebral or gastrointestinal, OR (4) prior recurrent (>2) history of falls.

Annotated entities:
- Observation: "risk of bleeding"
- Qualifier: "high"
- Measurement: "HASBLED score"
- Value: "=3"
- Measurement: "CHADS2VASC score"
- Condition: "severe bleeding"
- Qualifier: "type 3a, 3b, 3c"
- Qualifier: "cerebral"
- Qualifier: "gastrointestinal"
- Observation: "falls"
- Multiplier: ">2"
- Qualifier: "recurrent"